Clinical trial exclusion criterion:
Ongoing anaemia as indicated by haemoglobin values below the lower limit of the laboratory-specified reference range. If the finger prick method demonstrates an anaemia, no further protocol procedures will be performed, and the subject will be referred for appropriate medical management. The subject may participate in this study following therapy and evidence that the anaemia has been resolved.

Annotated entities:
- Temporal: "Ongoing"
- Condition: "anaemia"
- Measurement: "haemoglobin"
- Value: "below the lower limit of the laboratory-specified reference range"
- Procedure: "finger prick method"
- Condition: "anaemia"
- Non-representable: "and the subject will be referred for appropriate medical management. The subject may participate in this study following therapy and evidence that the anaemia has been resolved."